一位 10 個月大的女嬰慘遭生父丟入熱水鍋，肩頸以下 90%燒燙傷，因為女嬰的母親不忍看到女嬰接受到電擊，所以想要簽署放棄心肺復甦術同意書，依安寧緩和醫療條例（民國 91 年 12 月 11 日修正）之規定，下列敘述何者錯誤？
A. 不施行心肺復甦術，應由二位醫師診斷確定為末期病人
B. 未成年人簽署不施行心肺復甦術意願書時，應得其法定代理人之同意
C. 病人意識昏迷或無法清楚表達意願時，由其最近親屬出具不施行心肺復甦術同意書代替之
D. 不論任何人都不能替未成年人放棄施行心肺復甦術

正確答案：D. 不論任何人都不能替未成年人放棄施行心肺復甦術